關於骨質密度之敘述，下列何者錯誤？
A. 約於35～40歲時達到最強最硬，之後逐漸流失
B. 停經後2～3年，流失最快最多
C. 70歲以上，骨質流失速率女性比男性快
D. 抗地心引力之運動，可以增加骨質密度

正確答案：C. 70歲以上，骨質流失速率女性比男性快